Clinical trial exclusion criterion:
Chronic pain more than 3 months

Annotated entities:
- Condition: "Chronic pain"
- Temporal: "more than 3 months"